Clinical trial inclusion criterion:
Life expectancy of at least 12 months as per the investigator's judgement

Entity relations:
- Has_value("Life expectancy", "at least 12 months")